What is herceptin?

Herceptin is an oral, small molecule, poly (ADP-ribose) polymerase inhibitor that binds to HER2 and inhibits HER2 activation. It is approved for the treatment of breast cancer.